Clinical trial inclusion criterion:
If all lab results for quantitative IgA immunoglobulin level are lower than 15% below normal range, the subject may not proceed further in the screening process.

Entity relations:
- Has_value("quantitative IgA immunoglobulin level", "lower than 15% below normal range")